Clinical trial exclusion criterion:
Primary bone marrow failure;

Annotated entities:
- Condition: "Primary bone marrow failure"